The patient has previously received anti-tumor biological targeted therapy

The above is a clinical trial exclusion criterion. Annotated with entity spans:
The patient has [Temporal: previously] received [Procedure: anti-tumor biological targeted therapy]